¿Cuál de los siguientes procesos sería responsable de los resultados que se alcanzan mediante la meditación por mindfulness?:
1. Cambiar los contenidos de la mente.
2. Cambiar la relación con los contenidos de la mente.
3. Eliminar el papel de espectador de los contenidos de la mente.
4. Juzgar los contenidos de la mente.
5. Fundirse con los contenidos de la mente.

Respuesta correcta: 2. Cambiar la relación con los contenidos de la mente.